AST/ALT: ≤ 2.5 x ULN

The above is a clinical trial inclusion criterion. Annotated with entity spans:
[Measurement: AST/ALT]: [Value: ≤ 2.5 x ULN]